Clinical trial exclusion criterion:
12. Radiation therapy within 4 weeks prior to, or concurrent with study

Entity relations:
- multi("within 4 weeks prior to study", "study")
- multi("concurrent with study", "study")
- Has_temporal("Radiation therapy", "within 4 weeks prior to study")
- Has_temporal("Radiation therapy", "concurrent with study")